Clinical trial exclusion criterion:
Patients with preexisting neuromuscular conditions (myasthenia gravis, Eaton Lambert syndrome)

Annotated entities:
- Condition: "neuromuscular conditions"
- Condition: "myasthenia gravis"
- Condition: "Eaton Lambert syndrome"